Liver disease (cirrhosis or liver failure)

The above is a clinical trial exclusion criterion. Annotated with entity spans:
[Condition: Liver disease] ([Condition: cirrhosis] or [Condition: liver failure])